Clinical trial inclusion criterion:
1. Had a diagnosis of PHN, DN, CRPS, carpal tunnel syndrome, HIV neuropathy, idiopathic sensory neuropathy, or other peripheral neuropathy (upon mutual agreement of the sponsor and investigator)

Entity relations:
- causal("neuropathy", "HIV")
- multi("HIV neuropathy", "neuropathy")
- Has_qualifier("sensory neuropathy", "idiopathic")
- OR("PHN", "DN", "CRPS", "carpal tunnel syndrome", "HIV neuropathy", "sensory neuropathy", "peripheral neuropathy")